下列關於肱動脈的敘述，何者錯誤？
A. 肱動脈位在手臂內側，肱三頭肌及肱肌的前面
B. 與腋神經伴行的深肱動脈為肱動脈的分支
C. 腋動脈通過大圓肌下緣後稱為肱動脈
D. 肱動脈在手臂與正中神經伴行

正確答案：B. 與腋神經伴行的深肱動脈為肱動脈的分支